下列情況皆會發生代謝性鹼血症，檢查尿液的氯離子濃度時，下列何者與其他三種狀況不同？
A. 原發性皮質醛酮症（primary aldosteronism）
B. 病人使用鼻胃管引流
C. Gitelman's syndrome
D. 使用利尿劑

正確答案：B. 病人使用鼻胃管引流